12. Severe/untreated blood pressure (systolic 180 mm Hg, diastolic 95 mm Hg).

The above is a clinical trial exclusion criterion. Annotated with entity spans:
[Parsing_Error: 12.] [Qualifier: Severe]/[Qualifier: untreated] [Context_Error: blood pressure] ([Measurement: systolic] [Value: 180 mm Hg], [Measurement: diastolic] [Value: 95 mm Hg]).